Clinical trial inclusion criterion:
Age >= 65 years, < 90 years;

Annotated entities:
- Person: "Age"
- Value: ">= 65 years, < 90 years"